Clinical trial inclusion criterion:
An average defecation frequency (DF) of <3 per week based on a 3-week defecation diary (patient-reported)

Annotated entities:
- Measurement: "average defecation frequency"
- Measurement: "DF"
- Value: "<3 per week"
- Procedure: "3-week defecation diary"
- Qualifier: "patient-reported"